Accelerating angina or unstable angina

The above is a clinical trial exclusion criterion. Annotated with entity spans:
[Condition: Accelerating angina] or [Condition: unstable angina]